Clinical trial inclusion criterion:
Adult patients with T2DM who are indicated to receive liraglutide, not as first-line therapy, in addition to diet and exercise to improve glycemic control

Annotated entities:
- Person: "Adult"
- Condition: "T2DM"
- Drug: "liraglutide"
- Mood: "indicated to receive"
- Qualifier: "first-line therapy"
- Negation: "not"
- Non-representable: "in addition to diet and exercise to improve glycemic control"